Clinical trial inclusion criterion:
Singleton pregnancy = 37 weeks gestation

Annotated entities:
- Condition: "Singleton pregnancy"
- Value: "= 37 weeks"
- Measurement: "gestation"